Clinical trial exclusion criterion:
1. Subject is a post-menopausal woman, defined as either; six (6) months or more (immediately prior to screening visit) without a menstrual period, or prior hysterectomy and/or oophorectomy

Annotated entities:
- Parsing_Error: "1."
- Condition: "post-menopausal"
- Person: "woman"
- Temporal: "six (6) months or more"
- Temporal: "immediately prior to screening visit"
- Condition: "menstrual period"
- Negation: "without"
- Procedure: "hysterectomy"
- Temporal: "prior"
- Procedure: "oophorectomy"